Clinical trial exclusion criterion:
Patients who have a seizure disorder

Annotated entities:
- Condition: "seizure disorder"